¿Qué hallazgo de laboratorio espera encontrar en una paciente con anorexia nerviosa que realiza continuos vómitos?
1. Hipoamilasemia.
2. Disminución del bicarbonato sérico.
3. Hipocloremia.
4. Hiperpotasemia.

Respuesta correcta: 3. Hipocloremia.